Clinical trial exclusion criterion:
3. Pregnancy or expectation of pregnancy during the study.

Annotated entities:
- Condition: "Pregnancy"
- Mood: "expectation"
- Condition: "pregnancy"
- Temporal: "during the study"